Clinical trial inclusion criterion:
=1 ill-defined hyperfluorescent leakage areas on fluorescein angiography (FA) with retinal pigment epithelial window defect(s) that are compatible with cCSC;

Entity relations:
- Has_qualifier("hyperfluorescent leakage areas", "ill-defined")
- Has_multiplier("hyperfluorescent leakage areas", "=1")
- AND("fluorescein angiography (FA)", "hyperfluorescent leakage areas")
- AND("fluorescein angiography (FA)", "retinal pigment epithelial window defect(s)")